¿Cuál es el codón de inicio de la traducción y qué aminoácido codifica?
1. GAU, alanina.
2. UAA, leucina.
3. AUG, metionina.
4. AUU, triptófano.

Respuesta correcta: 3. AUG, metionina.